Axial spondyloarthritis (ASAS criteria) and radiologic sacroiliitis as detected either by MRI or X-ray.

The above is a clinical trial inclusion criterion. Annotated with entity spans:
[Condition: Axial spondyloarthritis] ([Qualifier: ASAS criteria]) and [Procedure: radiologic] [Condition: sacroiliitis] as detected either by [Procedure: MRI] or [Procedure: X-ray].